HIV infected participants who are on anti-retroviral drugs

The above is a clinical trial exclusion criterion. Annotated with entity spans:
[Condition: HIV infected] participants who are on [Drug: anti-retroviral drugs]